Clinical trial inclusion criterion:
Meet at least one other criterion of the Rome-IV criteria for idiopathic constipation based on the 3-week defecation diary (1)

Annotated entities:
- Multiplier: "at least one"
- Measurement: "Rome-IV criteria for idiopathic constipation"
- Condition: "idiopathic constipation"
- Procedure: "3-week defecation diary"
- Qualifier: "other"
- Condition: "criterion"